What is caused by loss-of-function variants in BCAS3?

BCAS3 microtubule-associated migration factor (BCAS3) is a large, highly tuned cytoskeletal protein previously proposed to be critical in angiogenesis and implicated in the growth of tumors. It has been linked to a syndromic neurodevelopmental disorder.